CNS or other severe organ manifestation of lupus that necessitate aggressive immunosuppressive therapy on its own.

The above is a clinical trial exclusion criterion. Annotated with entity spans:
[Qualifier: CNS] or other severe [Qualifier: organ manifestation] of [Condition: lupus] that necessitate aggressive [Procedure: immunosuppressive therapy] on its own.